Facilities with a resident population with >=20% combative patients

The above is a clinical trial exclusion criterion. Annotated with entity spans:
Facilities with a [Measurement: resident population] with [Value: >=20%] [Observation: combative patients]